Clinical trial exclusion criterion:
18. Concomitant administration of oral contraceptives (may be included with 7-day washout period)

Annotated entities:
- Parsing_Error: "18."
- Drug: "oral contraceptives"
- Temporal: "Concomitant"
- Not_a_criteria: "(may be included with 7-day washout period)"